王女士為 86 歲之獨居老人，平常可自理生活。最近一個禮拜常在自家附近遊蕩，並斥責鄰居意圖謀奪其財產，三天前曾對女兒描述看到已過世之父親回家來看她。王女士自昨天開始不吃不喝且躲在自家的牆角，因熟識之鄰居發現報警而被救護車帶至醫院。於病史詢問及精神狀態檢查時，發現其有明顯之注意力障礙且言談無法切題連貫，據鄰居描述於近一個禮拜來，其病程有起伏，亦曾出現較清醒之狀態。王女士最可能的精神科診斷為：
A. 痴呆
B. 譫妄
C. 精神分裂症
D. 分裂情感障礙

正確答案：B. 譫妄